Clinical trial exclusion criterion:
Any surgical or medical condition, which in the opinion of the investigator, may place the patient at higher risk from his/her participation in the study, or is likely to prevent the patient from complying with the requirements of the study or completing the study

Entity relations:
- AND("surgical condition", "in the opinion of the investigator")
- Has_qualifier("surgical condition", "place the patient at higher risk from his/her participation in the study")
- Has_mood("complying with the requirements of the study", "likely to prevent the patient from")
- AND("surgical condition", "complying with the requirements of the study")
- multi("likely to prevent the patient from", "prevent")
- OR("surgical condition", "medical condition")